Clinical trial exclusion criteria:
Renal disease unrelated to SLE (e.g. diabetes mellitus, other glomerular or tubulointerstitial disease, renovascular disease), or transplanted kidney.
Estimated glomerular filtration rate (eGFR by MDRD) =20 mL/min per 1.73 m2 or serum creatinine >300 micromol/L (3.39 mg/dL) at screening.
Renal biopsy showing cellular or fibrocellular crescent in more than 25% of glomeruli.
CNS or other severe organ manifestation of lupus that necessitate aggressive immunosuppressive therapy on its own.
Co-morbidities that require corticosteroid therapy (e.g. asthma, inflammatory bowel disease).
Treatment with prednisolone (or prednisone, or equivalent) at >20 mg/D for over 4 weeks within the past 3 months.
Treatment with MMF at >1.5 g/D for over 4 weeks within the past 3 months.
Known hypersensitivity or intolerability to prednisolone (or prednisone, or equivalent), TAC, or MMF at a dose of 1.25 g or below per day.
Subjects who are already on treatment with TAC, cyclosporine or any other calcineurin inhibitor for over 4 weeks within the past 12 months.
Treatment with cyclophosphamide, leflunomide, or methotrexate for over 2 weeks, or use of biological agent(s) regardless of duration, within the past 6 months (Note: prior use of azathioprine, mizoribine, intravenous immunoglobulins and anti-malarials is allowed).
Uncontrolled hypertension with systolic BP >160 mmHg or diastolic BP >95 mmHg.
Women who are pregnant or breastfeeding.
Women with childbearing potential or their male partners, who refuse to use an effective birth control method

Annotated entities:
- Condition: "Renal disease"
- Negation: "unrelated"
- Condition: "SLE"
- Condition: "diabetes mellitus"
- Condition: "tubulointerstitial disease"
- Condition: "glomerular disease"
- Condition: "renovascular disease"
- Procedure: "transplanted kidney"
- Measurement: "Estimated glomerular filtration rate"
- Measurement: "eGFR"
- Value: "=20 mL/min per 1.73 m2"
- Measurement: "serum creatinine"
- Value: ">300 micromol/L"
- Value: "3.39 mg/dL"
- Procedure: "Renal biopsy"
- Condition: "fibrocellular crescent"
- Condition: "cellular crescent"
- Multiplier: "more than 25% of glomeruli"
- Qualifier: "CNS"
- Condition: "lupus"
- Qualifier: "organ manifestation"
- Procedure: "immunosuppressive therapy"
- Drug: "corticosteroid therapy"
- Condition: "asthma"
- Condition: "inflammatory bowel disease"
- Condition: "Co-morbidities"
- Drug: "prednisolone"
- Drug: "prednisone"
- Drug: "prednisone equivalent"
- Multiplier: ">20 mg/D for over 4 weeks"
- Temporal: "past 3 months"
- Drug: "MMF"
- Multiplier: ">1.5 g/D for over 4 weeks"
- Temporal: "past 3 months"
- Condition: "hypersensitivity"
- Condition: "intolerability"
- Drug: "prednisolone"
- Drug: "prednisone"
- Drug: "prednisone equivalent"
- Drug: "TAC"
- Drug: "MMF"
- Multiplier: "1.25 g or below per day"
- Drug: "TAC"
- Drug: "cyclosporine"
- Drug: "calcineurin inhibitor"
- Multiplier: "over 4 weeks"
- Temporal: "past 12 months."
- Drug: "cyclophosphamide"
- Drug: "leflunomide"
- Drug: "methotrexate"
- Multiplier: "2 weeks"
- Procedure: "biological agent"
- Temporal: "past 6 months"
- Negation: "allowed"
- Drug: "azathioprine"
- Drug: "mizoribine"
- Drug: "immunoglobulins"
- Drug: "anti-malarials"
- Condition: "hypertension"
- Qualifier: "Uncontrolled"
- Measurement: "systolic BP"
- Measurement: "diastolic BP"
- Value: ">160 mmHg"
- Value: ">95 mmHg"
- Pregnancy_considerations: "Women who are pregnant or breastfeeding"
- Pregnancy_considerations: "Women with childbearing potential or their male partners, who refuse to use an effective birth control method"